甲狀腺腫瘤手術時，為防止出血而綁住喉上動脈（superior laryngeal a.），此時最可能誤傷下列何者？
A. 喉外神經（external laryngeal nerve）
B. 喉下神經（inferior laryngeal nerve）
C. 迷走神經（vagus nerve）
D. 喉內神經（internal laryngeal nerve）

正確答案：D. 喉內神經（internal laryngeal nerve）